下列何者不是邊緣惡性卵巢腫瘤（borderline tumors）的診斷條件（criteria）？
A. 上皮細胞呈現乳突狀構造（papillary formation）及偽多層（pseudostratification）
B. 細胞核異常（atypia）
C. 細胞有絲分裂增加
D. 可見基質侵犯（stromal invasion）

正確答案：D. 可見基質侵犯（stromal invasion）